Conversion to open laparotomy from laparoscopic surgery

The above is a clinical trial exclusion criterion. Annotated with entity spans:
[Observation: Conversion] to [Procedure: open laparotomy] from [Procedure: laparoscopic surgery]